Contraindications to empagliflozin, Sitagliptin

The above is a clinical trial exclusion criterion. Annotated with entity spans:
[Condition: Contraindications] to [Drug: empagliflozin], [Drug: Sitagliptin]